下列有關視神經（optic nerve）及其軸突的敘述，何者正確？
A. 由視網膜之光受器細胞形成
B. 為實心構造，血管分布在最外圍
C. 在眼窩中被硬腦膜鞘（sheath of dura）及蜘蛛膜下腔包圍
D. 具有 Schwann 氏細胞構成的髓鞘

正確答案：C. 在眼窩中被硬腦膜鞘（sheath of dura）及蜘蛛膜下腔包圍